Contraindication to general anesthesia,

The above is a clinical trial exclusion criterion. Annotated with entity spans:
[Condition: Contraindication] to [Procedure: general anesthesia],